Que las profesiones tengan un “bien interno” que las define, significa que tienen:
1. Un compromiso moral y unos fines que han de alcanzarse mediante el cumplimiento de ciertos principios y la observación de ciertos valores.
2. Una ética profesional intrínseca a esa profesión que la define, la dota de sentido y justifica su existencia y valor.
3. Que ser desarrolladas por profesionales altamente cualificados académicamente.
4. Que sustentarse por leyes y normas dictadas por los máximos responsables sanitarios.
5. Las respuestas 1 y 2 son las correctas.

Respuesta correcta: 5. Las respuestas 1 y 2 son las correctas.